Age =18 years

The above is a clinical trial inclusion criterion. Annotated with entity spans:
[Person: Age] [Value: =18 years]